Clinical trial exclusion criterion:
History of claustrophobia

Entity relations:
- Has_temporal("claustrophobia", "History")